Pregnant

The above is a clinical trial inclusion criterion. Annotated with entity spans:
[Condition: Pregnant]